Clinical trial inclusion criterion:
between 7 to 70 years of age

Entity relations:
- Has_value("age", "between 7 to 70 years")